Clinical trial exclusion criterion:
severe hepatic impairment

Annotated entities:
- Condition: "hepatic impairment"
- Qualifier: "severe"